Clinical trial exclusion criterion:
Serum creatinine > 1.7mg/dL

Entity relations:
- Has_value("Serum creatinine", "> 1.7mg/dL")